Clinical trial inclusion criterion:
Compensated liver disease

Entity relations:
- Has_qualifier("liver disease", "Compensated")